Clinical trial exclusion criterion:
Hepatitis B or C infection

Entity relations:
- OR("Hepatitis C infection", "Hepatitis B infection")